Clinical trial exclusion criterion:
hearing is better than 30 deciBel (dB) in pure tone average (500, 1000, 2000, 3-4000 Hz) and speech discrimination better than 70%

Annotated entities:
- Measurement: "hearing"
- Value: "better than 30 deciBel (dB)"
- Qualifier: "pure tone average"
- Qualifier: "500, 1000, 2000, 3-4000 Hz"
- Measurement: "speech discrimination"
- Value: "better than 70%"